下列何者與促進細胞攝取血液中膽固醇有關？
A. Apo B-100
B. Apo C-I
C. Apo C-II
D. lipoprotein lipase

正確答案：A. Apo B-100